Clinical trial inclusion criteria:
patient hospitalized in critical care units
patient infected by multi drug resistant Gram negative bacteria susceptibly only to colistin
source of infection: blood, respiratory, intra abdominal or urinary

Annotated entities:
- Procedure: "hospitalized"
- Visit: "critical care units"
- Qualifier: "multi drug resistant"
- Condition: "Gram negative bacteria"
- Observation: "susceptibly"
- Multiplier: "only"
- Drug: "colistin"
- Non-representable: "source of infection: blood, respiratory, intra abdominal or urinary"